Blood Pressure =140/90 mmHg

The above is a clinical trial exclusion criterion. Annotated with entity spans:
[Measurement: Blood Pressure] [Value: =140/90 mmHg]